服用中草藥產生腎衰竭病人的腎臟切片明顯可見腎小管及間質纖維化但較少細胞浸潤，中草藥內含的那一項物質最有可能引發上述疾病？
A. 鈣
B. 鎂
C. Arachidonic acid
D. 馬兜鈴酸（aristolochic acid）

正確答案：D. 馬兜鈴酸（aristolochic acid）